Clinical trial exclusion criterion:
rheumatoid arthritis

Annotated entities:
- Condition: "rheumatoid arthritis"